以下關於原發型自發性氣胸（primary spontaneous pneumothorax）之治療何者錯誤？
A. 第一次發作時，若氣胸量<20%，可以考慮觀察，不須置放胸管
B. 第二次氣胸發作時，如果和第一次氣胸同側，則應接受手術，但若不同側，則不應手術
C. 氣胸手術治療時，除了切除氣泡外，還應施行肋膜沾黏術（pleurodesis），以減少日後復發的機率
D. 當氣胸接受胸管置放 72 小時仍有持續漏氣時，則應考慮手術治療

正確答案：B. 第二次氣胸發作時，如果和第一次氣胸同側，則應接受手術，但若不同側，則不應手術